Clinical trial inclusion criterion:
AST < 10 x ULN

Entity relations:
- Has_value("AST", "< 10 x ULN")